Subjects were not to have donated blood within 90 days prior to study initiation.

The above is a clinical trial exclusion criterion. Annotated with entity spans:
Subjects were [Negation: not] to have [Procedure: donated blood] [Temporal: within 90 days prior to study initiation].